一位 22 歲男性病人，睪丸手術後即反應傷口劇痛，發現陰囊有巨大血腫塊。病人血球計數正常，凝血酶原時間（PT）正常，部分促凝血酶原激酶時間（aPTT）延長，血纖維蛋白原（fibrinogen）正常。必須加做下列那些測試才能獲得正確之診斷？①aPTT 矯正測試（correction studies of aPTT） ②出血時間（bleeding time） ③第八或第九凝血因子測試（factor VIII or factor IX assays） ④第七凝血因子測試（factor VII assay）
A. ①③
B. ②④
C. ①②③
D. ①②④

正確答案：C. ①②③